Which mutated enzyme is responsible for oculocutaneous 1 (OCA1)-type albinism?

Mutations in the gene for tyrosinase (TYR), the key enzyme in melanin synthesis, are responsible for oculocutaneous 1 (OCA1)-type albinism.